palpable cord

The above is a clinical trial inclusion criterion. Annotated with entity spans:
[Condition: palpable cord]